Clinical trial exclusion criterion:
Any cases giving clinical symptoms of gastritis e.g. nausea, vomiting, dull aching pain or soreness in the epigastrium.

Annotated entities:
- Mood: "clinical symptoms"
- Condition: "gastritis"
- Condition: "nausea"
- Condition: "vomiting"
- Condition: "dull aching pain"
- Condition: "soreness in the epigastrium"